在非傷害性（non-noxious）刺激下，仍會感覺到疼痛，稱為：
A. neuralgia
B. allodynia
C. hyperalgesia
D. hyperesthesia

正確答案：B. allodynia